"Currant-jelly＂stool 與那一疾病最有關係？
A. 腸息肉
B. 梅克耳憩室（Meckel's diverticulum）
C. 腸套疊
D. 直腸炎

正確答案：C. 腸套疊